What does "28" stand for in the Disease Activity Score DAS28?

DAS28 is a subjective Disease Activity Score in Rheumatoid Arthritis patients that checks 28 individual joints.